Clinical trial exclusion criterion:
Suspicion of chorioamnionitis

Entity relations:
- Has_mood("chorioamnionitis", "Suspicion of")